關於胰臟內分泌瘤（pancreatic endocrine tumor）之敘述，下列何者錯誤？
A. 對於有反覆發作難治癒型的消化性潰瘍、嚴重食道發炎或是持續性腹瀉的病人，必須要考慮是否有Zollinger-Ellison
B. 在Zollinger-Ellison syndrome的病人中有75%其gastrinoma是偶發性的，但有25%的病人是合併有MEN 1 syndrome
C. 所謂MEN 1 syndrome為染色體第11對突變之顯性遺傳，最常見的是有parathyroid tumor、prostate cancer及pancreatic endocrine tumor
D. 對於同時合併有副甲狀腺亢進及 pancreatic endocrine tumor的MEN 1病人，要優先處理副甲狀腺亢進的問題

正確答案：C. 所謂MEN 1 syndrome為染色體第11對突變之顯性遺傳，最常見的是有parathyroid tumor、prostate cancer及pancreatic endocrine tumor